Clinical trial exclusion criterion:
History of drug or alcohol abuse within the 12 months prior to dosing.

Entity relations:
- AND("History", "drug abuse")
- Has_temporal("drug abuse", "within the 12 months prior")
- OR("drug abuse", "alcohol abuse")